下列何者與神經性梅毒（neurosyphilis）較無關？
A. tabes dorsalis
B. general paresis
C. Marcus-Gunn pupils
D. lancinating or lightning pains

正確答案：C. Marcus-Gunn pupils